Clinical trial inclusion criterion:
HFpEF: physician-confirmed diagnosis of HF, symptomatic HF, LVEF at least 50%, elevated LV filling pressure by catheterization, echocardiographic criteria or B-type-natriuretic peptide > 100, current BP < 160/90

Annotated entities:
- Condition: "HFpEF"
- Qualifier: "physician-confirmed"
- Condition: "HF"
- Qualifier: "symptomatic"
- Condition: "HF"
- Measurement: "LVEF"
- Value: "at least 50%"
- Value: "elevated"
- Measurement: "LV filling pressure"
- Procedure: "catheterization"
- Non-representable: "echocardiographic criteria"
- Measurement: "B-type-natriuretic peptide"
- Value: "> 100"
- Measurement: "current BP"
- Value: "< 160/90"